下列何種刺激，比較不會引起氣喘發作？
A. 過敏原
B. 呼吸道感染
C. 情緒變化
D. 游泳

正確答案：D. 游泳